What is a fibrocyte?

Fibrocytes are bone marrow-derived progenitor cells that produce growth factors and contribute to fibrogenesis in the lungs. Fibrocytes are circulating mesenchymal precursors (CD45+, col 1+) recruited to fibrotic areas.